血漿滲透度為 150 mOsm 時，則下列何者正確？
A. 對細胞而言是高張（hypertonic）
B. 將會造成血量（blood volume）的增加
C. 將會抑制抗利尿激素（antidiuretic hormone）釋放
D. 將會刺激渴覺中樞之滲透度感受器（osmoreceptors）而飲用大量的水

正確答案：C. 將會抑制抗利尿激素（antidiuretic hormone）釋放